Early pregnancy body weight is 50-90 Kg

The above is a clinical trial inclusion criterion. Annotated with entity spans:
[Temporal: Early pregnancy] [Measurement: body weight] is [Value: 50-90 Kg]